Any condition that in the investigator's opinion would make the subject unable to adhere to the trial visit schedule and procedures

The above is a clinical trial exclusion criterion. Annotated with entity spans:
[Post-eligibility: Any condition that in the investigator's opinion would make the subject unable to adhere to the trial visit schedule and procedures]